Subjects with residual refractive error.

The above is a clinical trial inclusion criterion. Annotated with entity spans:
Subjects with [Condition: residual refractive error].